Documented renal failure

The above is a clinical trial exclusion criterion. Annotated with entity spans:
Documented [Condition: renal failure]